Una persona adulta con un Shock Anafiláctico tendrá las siguientes manifestaciones cardiovasculares. Señale la respuesta correcta:
1. Bradicardia, hipotensión arterial y arritmias.
2. Taquicardia, hipotensión arterial y signos de hipoperfusión periférica.
3. Taquicardia, hipotensión arterial y poliuria.
4. Taquicardia, hipertensión arterial y signos de hipoperfusión periférica.

Respuesta correcta: 2. Taquicardia, hipotensión arterial y signos de hipoperfusión periférica.